Patients with any inflammatory diseases requiring chronic anti-inflammatory therapy

The above is a clinical trial exclusion criterion. Annotated with entity spans:
Patients with any [Condition: inflammatory diseases] requiring [Qualifier: chronic] [Procedure: anti-inflammatory therapy]